Participants with prostate specific antigen (PSA) > 3.0 ng/mL (or 1.5 if on 5-alpha reductase inhibitors)

The above is a clinical trial exclusion criterion. Annotated with entity spans:
Participants with [Measurement: prostate specific antigen (PSA)] [Value: > 3.0 ng/mL] (or [Value: 1.5] if on [Drug: 5-alpha reductase inhibitors])